Which proteins does RG-7992 target?

BFKB8488A is a bispecific antibody against FGFR1 and KLB.